Clinical trial inclusion criterion:
Subjects aged 12-65.

Entity relations:
- Has_value("aged", "12-65")